Past history of systemic steroid use over 2 weeks within the last 2 years

The above is a clinical trial exclusion criterion. Annotated with entity spans:
[Temporal: Past history] of [Drug: systemic steroid] use [Temporal: over 2 weeks] [Temporal: within the last 2 years]